Clinical trial exclusion criterion:
Chronic liver disease (Cirrhosis, malignancy and patients with more than twice the upper limit of liver function tests)

Annotated entities:
- Condition: "Chronic liver disease"
- Condition: "Cirrhosis"
- Condition: "malignancy"
- Value: "more than twice the upper limit"
- Measurement: "liver function tests"